Clinical trial exclusion criterion:
Current hormone replacement therapy;

Entity relations:
- Has_temporal("hormone replacement therapy", "Current")